Clinical trial exclusion criterion:
Cardiogenic shock.

Annotated entities:
- Condition: "Cardiogenic shock"